use of loop diuretics

The above is a clinical trial exclusion criterion. Annotated with entity spans:
use of [Drug: loop diuretics]